林小姐因子宮外孕合併內出血入院，入院時血色素：7.8 mg/dL，醫師告以須手術與輸血治療，但病患及家屬因其宗教信仰之故，同意手術但堅持不願輸血，醫師認為輸血為必要之處置，仍決定輸血，醫師行為是否恰當？
A. 是。因醫師需盡其最大救治義務為病患診治
B. 是。因醫師有全權決定如何醫療
C. 否。因此臨床處置與病人意願相違
D. 否。因家屬反對

正確答案：C. 否。因此臨床處置與病人意願相違